Clinical trial exclusion criterion:
Haematological disorders (Anaemia, malignancy, bleeding disorders)

Annotated entities:
- Condition: "Haematological disorders"
- Condition: "Anaemia"
- Condition: "malignancy"
- Condition: "bleeding disorders"